Acude al Servicio de Urgencias un hombre de 72 años con una fractura patológica en fémur izquierdo. Tras la intervención quirúrgica, se realiza el estudio diagnóstico para averiguar la patología subyacente con los siguientes hallazgos: hemoglobina 9,5 g/dl, proteínas totales 11 g/dl, (VN: 6-8 g/dl), albúmina sérica 2 g/dl,(VN 3,5-5,0 g/dl), beta 2 microglobulina 6 mg/l (VN 1,1-2,4 mg/l), creatinina sérica 1,8 mg/dl (VN: 0,1-1,4 mg/dl). Indique cuáles serían las pruebas diagnósticas necesarias para confirmar el diagnóstico más probable:
1. Serie ósea radiológica y aspirado de médula ósea.
2. Electroforesis sérica y urinaria y pruebas de función renal.
3. Aspirado de médula ósea y concentración de calcio sérico.
4. Aspirado de médula ósea y electroforesis sérica y urinaria.
5. Biopsia de la fractura patológica y serie ósea radiológica.

Respuesta correcta: 4. Aspirado de médula ósea y electroforesis sérica y urinaria.